Clinical trial inclusion criterion:
· creatinine ≤ 1.5 x ULN

Entity relations:
- Has_value("creatinine", "≤ 1.5 x ULN")